Clinical trial inclusion criteria:
Age between 18 and 78 year-old.
Previous liver transplantation(more than 6 month).
Genotype 1 and 4 infection.
Hepatitis C recurrence defined by the presence of abnormal liver function test, positive HCV-RNA, histological signs of hepatitis C recurrence.
Viral load ≥10000UI/mL.
Immunosuppression with tacrolimus and/or mycophenolate (Prednisone use is allowed at low dose, ≤10 mg/d).
Treatment naïve or treatment experienced (Peg-RBV or triple therapy).

Annotated entities:
- Person: "Age"
- Value: "between 18 and 78 year-old"
- Procedure: "liver transplantation"
- Temporal: "Previous"
- Temporal: "more than 6 month"
- Measurement: "Genotype"
- Value: "1 and 4"
- Condition: "infection"
- Condition: "Hepatitis C"
- Multiplier: "recurrence"
- Measurement: "liver function test"
- Value: "abnormal"
- Measurement: "HCV-RNA"
- Value: "positive"
- Procedure: "histological"
- Condition: "hepatitis C"
- Multiplier: "recurrence"
- Condition: "histological signs of hepatitis C recurrence"
- Measurement: "Viral load"
- Value: "≥10000UI/mL"
- Procedure: "Immunosuppression"
- Drug: "tacrolimus"
- Drug: "mycophenolate"
- Drug: "Prednisone"
- Multiplier: "low dose"
- Value: "≤10 mg/d"
- Condition: "Treatment naïve"
- Condition: "treatment experienced"
- Procedure: "Peg-RBV"
- Procedure: "triple therapy"